Clinical trial inclusion criterion:
Subject is able to produce sputum, undergo phlebotomy, and provide written consent.

Annotated entities:
- Post-eligibility: "Subject is able to produce sputum, undergo phlebotomy, and provide written consent."